Poorly controlled hypertension (>170/>110)

The above is a clinical trial exclusion criterion. Annotated with entity spans:
[Qualifier: Poorly controlled] [Condition: hypertension] (>170/>110)